捏擠龜頭或者摩擦陰蒂可以引起肛門外括約肌收縮的是什麼反射？
A. 肛門反射（anal reflex）
B. 球海綿體肌反射（bulbocavernosus reflex）
C. 提睪肌反射（cremasteric reflex）
D. 逼尿肌反射（detrusor reflex）

正確答案：B. 球海綿體肌反射（bulbocavernosus reflex）